Clinical trial exclusion criteria:
Diagnosis of primary progressive MS
Inability to complete an MRI (contraindications for MRI include but are not restricted to weight =140 kg, pacemaker, cochlear implants, presence of foreign substances in the eye, intracranial vascular clips, surgery within 6 weeks of entry into the study, coronary stent implanted within 8 weeks prior to the time of the intended MRI, etc…)
Gadolinium intolerance
History of ischemic cerebrovascular disorders (e.g., stroke, transient ischemic attack) or ischemia of the spinal cord
History or known presence of central nervous system (CNS) or spinal cord tumor (e.g., meningioma, glioma)
History or known presence of potential metabolic causes of myelopathy (e.g., untreated vitamin B12 deficiency)
History or known presence of infectious causes of myelopathy (e.g., syphilis, Lyme disease, human T-lymphotropic virus 1 (HTLV-1), herpes zoster myelopathy)
History of genetically inherited progressive CNS degenerative disorder (e.g., hereditary paraparesis; MELAS [mitochondrial myopathy, encephalopathy, lactic acidosis, stroke] syndrome)
Neuromyelitis optica
History or known presence of systemic autoimmune disorders potentially causing progressive neurologic disease (e.g., lupus, anti-phospholipid antibody syndrome, Sjogren's syndrome, Behçet's disease, sarcoidosis)
History of severe, clinically significant brain or spinal cord trauma (e.g., cerebral contusion, spinal cord compression)
Vulnerable patients (Patient referred to in Articles L. 1121-5 to L. 1121-8 and L. 1122-1-2 of the French Public Health Code)

Annotated entities:
- Condition: "progressive MS"
- Qualifier: "primary"
- Procedure: "MRI"
- Mood: "Inability to complete"
- Condition: "contraindications"
- Procedure: "MRI"
- Measurement: "weight"
- Value: "=140 kg"
- Device: "pacemaker"
- Device: "cochlear implants"
- Device: "foreign substances in the eye"
- Device: "intracranial vascular clips"
- Procedure: "surgery"
- Temporal: "within 6 weeks of entry into the study"
- Reference_point: "entry into the study"
- Device: "coronary stent"
- Procedure: "implanted"
- Temporal: "within 8 weeks prior to the time of the intended MRI"
- Reference_point: "the time of the intended MRI"
- Procedure: "MRI"
- Mood: "intended"
- Condition: "intolerance"
- Drug: "Gadolinium"
- Condition: "ischemic cerebrovascular disorders"
- Condition: "stroke"
- Condition: "transient ischemic attack"
- Condition: "ischemia of the spinal cord"
- Condition: "central nervous system (CNS) tumor"
- Condition: "spinal cord tumor"
- Condition: "meningioma"
- Condition: "glioma"
- Condition: "myelopathy"
- Condition: "metabolic causes"
- Condition: "vitamin B12 deficiency"
- Qualifier: "untreated"
- Condition: "infectious causes"
- Condition: "myelopathy"
- Condition: "syphilis"
- Condition: "Lyme disease"
- Condition: "human T-lymphotropic virus 1 (HTLV-1)"
- Condition: "herpes zoster myelopathy"
- Condition: "progressive CNS degenerative disorder"
- Qualifier: "genetically inherited"
- Condition: "hereditary paraparesis"
- Condition: "mitochondrial myopathy"
- Condition: "encephalopathy"
- Condition: "lactic acidosis"
- Condition: "stroke"
- Condition: "MELAS syndrome"
- Condition: "Neuromyelitis optica"
- Temporal: "History"
- Condition: "systemic autoimmune disorders"
- Condition: "progressive neurologic disease"
- Mood: "potentially causing"
- Condition: "lupus"
- Condition: "anti-phospholipid antibody syndrome"
- Condition: "Sjogren's syndrome"
- Condition: "Behçet's disease"
- Condition: "sarcoidosis"
- Qualifier: "severe"
- Qualifier: "clinically significant"
- Condition: "spinal cord trauma"
- Condition: "brain trauma"
- Condition: "cerebral contusion"
- Condition: "spinal cord compression"
- Observation: "Vulnerable patients"
- Qualifier: "Articles L. 1121-5 to L. 1121-8 and L. 1122-1-2 of the French Public Health Code"